Clinical trial inclusion criterion:
Patient is a primary liver transplant recipient

Annotated entities:
- Condition: "primary liver transplant"
- Person: "recipient"